有一間歇性腹瀉（chronic intermittent diarrhea）的病患，在其糞便中發現大小約2.3 mm的蟲體，除口、腹吸盤特徵外，在生殖孔附近有第三吸盤，該病患最可能感染下列何種寄生蟲？
A. 人雙口吸蟲（Gastrodiscoides hominis）
B. 異形吸蟲（Heterophyes heterophyes）
C. 槍狀肝吸蟲（Dicrocoelium dendriticum）
D. 橫川吸蟲（Metagonimus yokogawai）

正確答案：B. 異形吸蟲（Heterophyes heterophyes）